流行病學研究發現，移民美國第一代的日本人死於胃癌的比率小於原日本住民，但高於當地美國人；移民美國第二代的日本人死於胃癌的比率小於移民美國第一代的日本人，但仍高於當地美國人。由這研究結果所得到的推論，何者為最適當？
A. 癌症的發生僅與環境有關
B. 癌症的發生僅與基因遺傳有關
C. 環境與基因遺傳均可影響癌症的發生
D. 年齡是影響癌症發生的因素

正確答案：C. 環境與基因遺傳均可影響癌症的發生